下列何者不會在膜內骨生成（intramembraneous bone formation）過程中出現？
A. 類骨質（osteoid）
B. 骨針（bone spicules）
C. 透明軟骨（hyaline cartilage）
D. 初級骨髓（primary bone marrow）

正確答案：C. 透明軟骨（hyaline cartilage）